De acuerdo con el Sistema de Clasificación Biofamecéutica, un fármaco que presenta baja permeabilidad y alta solubilidad como, por ejemplo, la cimetidina, es un fármaco de:
1. Clase I.
2. Clase II.
3. Clase III.
4. Clase IV.
5. Clase V.

Respuesta correcta: 3. Clase III.